menstrual disorder,

The above is a clinical trial inclusion criterion. Annotated with entity spans:
[Condition: menstrual disorder],